有關顏面外傷與骨折（facial trauma & fracture）的處置，下列敘述何者錯誤？
A. 前額骨骨折（forehead fracture)要考慮前額竇及顱底是否傷害
B. 如果有嚴重鼻眼篩（nasal-orbitoethmoid）或顱底骨折應給予鼻氣管插管（nasotracheal intubation）維持
C. 上下頷顎骨骨折病人並不一定要做氣管切開術（tracheostomy），用氣管內管（endotracheal tube）也可維持呼吸道通暢
D. 下頜骨骨折（mandibular fracture）的處理，強調穩定的內固定及咬合的穩定

正確答案：B. 如果有嚴重鼻眼篩（nasal-orbitoethmoid）或顱底骨折應給予鼻氣管插管（nasotracheal intubation）維持